concomitant biofeedback

The above is a clinical trial exclusion criterion. Annotated with entity spans:
[Temporal: concomitant] [Procedure: biofeedback]